Male and female subjects between 40-85 years old will be enrolled. Younger subjects are not included as the risk for brain amyloid lesions is too low

The above is a clinical trial inclusion criterion. Annotated with entity spans:
[Person: Male] and [Person: female] subjects [Value: between 40-85 years] [Person: old] will be enrolled. [Non-representable: Younger subjects are not included as the risk for brain amyloid lesions is too low]